En relación con la artrosis, ¿qué afirmación es correcta?
1. Hay una estrecha correlación entre los hallazgos radiológicos y la sintomatología de los pacientes.
2. La afectación sintomática de la cadera es mucho más frecuente que la afectación de la rodilla.
3. La obesidad no se ha demostrado que sea un factor de riesgo para su desarrollo.
4. La presencia de una velocidad de sedimentación elevada apoya fuertemente el diagnóstico.
5. La rigidez matutina habitualmente dura menos de 30 minutos.

Respuesta correcta: 5. La rigidez matutina habitualmente dura menos de 30 minutos.